Unable to self-care or mental disease without caregiver.

The above is a clinical trial exclusion criterion. Annotated with entity spans:
[Condition: Unable to self-care] or [Condition: mental disease] [Qualifier: without caregiver].